Clinical trial exclusion criterion:
hypersensitivity to selective 5-HT receptor antagonists

Entity relations:
- AND("hypersensitivity", "selective 5-HT receptor antagonists")